Clinical trial inclusion criteria:
Patient is indicated to have an ocular refractive surgery performed (myopia, astigmatism, hypermetropy) by the Lasik method.
Patient presents a normal eye fundus.
Patient has intraocular pressure (IOP) ≤ 20 mmHg.

Annotated entities:
- Procedure: "ocular refractive surgery"
- Condition: "indicated to have an ocular refractive surgery performed"
- Condition: "myopia"
- Condition: "astigmatism"
- Condition: "hypermetropy"
- Qualifier: "Lasik method"
- Condition: "normal eye fundus"
- Measurement: "eye fundus"
- Value: "normal"
- Measurement: "intraocular pressure (IOP)"
- Value: "≤ 20 mmHg"